一位 47 歲子宮頸癌第 IB1 期的婦女，進行根除性子宮全切除術後，造成解尿困難，下列何者是最常見的原因？
A. 骨盆底肌肉過度緊張
B. 尿道出口阻塞
C. 術後膀胱周圍的組織腫脹
D. 下泌尿道的支配神經受損

正確答案：D. 下泌尿道的支配神經受損